60 歲男性病人，因發燒，右側胸痛而住院。胸部 X 光片顯示有中度右側肋膜腔積水，抽水檢查顯示其為 exudate，WBC 10,800/mm3，且細胞主要為多核中性白血球（90%），pH 值為 6.9，Sugar 為 30 mg/dL，下列何者為最適當之處理？
A. 給與抗生素治療，併追蹤胸部 X 光片
B. 給與抗生素治療，併給與胸管插入引流
C. 給與抗生素治療，併在 24 小時內再度抽水檢查
D. 給與抗肺結核藥物治療

正確答案：B. 給與抗生素治療，併給與胸管插入引流